有關非類固醇抗發炎藥物（NSAIDs）引起的胃病變敘述，下列何者正確？
A. 同時服用 aspirin 及 COX-2 抑制劑與只用 COX-2 抑制劑的腸胃出血風險相當
B. 抗血小板藥物 clopidogrel 並不會引起胃腸出血
C. 發生胃腸出血的風險為 indomethacin＞diclofenac＞ibuprofen
D. COX-2 抑制劑可減少胃腸出血的風險，但可能增加心血管風險，而非選擇性 NSAID 則不會增加心血管風險

正確答案：C. 發生胃腸出血的風險為 indomethacin＞diclofenac＞ibuprofen